Clinical trial inclusion criteria:
Healthy male and/or female subjects between the ages of 18 and 55 years, and a body mass index (BMI) of ≥ 18 and ≤ 33 kg/m2 with body weight ≥ 50 and ≤ 90 kg at screening.
Females must have been surgically sterilized (hysterectomy, bilateral oophorectomy, or bilateral salpingo-oophorectomy; proper documentation required) at least 6 months before screening, or be postmenopausal (defined as 24 consecutive months without menses before screening, with a follicle-stimulating hormone [FSH] level of > 40 IU/L at screening).

Annotated entities:
- Person: "male"
- Condition: "Healthy"
- Person: "female"
- Person: "ages"
- Value: "between 18 and 55 years"
- Measurement: "body mass index (BMI)"
- Value: "≥ 18 and ≤ 33 kg/m2"
- Measurement: "body weight"
- Value: "≥ 50 and ≤ 90 kg"
- Temporal: "at screening"
- Reference_point: "screening"
- Person: "Females"
- Condition: "surgically sterilized"
- Procedure: "hysterectomy"
- Procedure: "bilateral oophorectomy"
- Procedure: "bilateral salpingo-oophorectomy"
- Temporal: "at least 6 months before"
- Reference_point: "screening"
- Condition: "postmenopausal"
- Temporal: "24 consecutive months"
- Condition: "menses"
- Negation: "without"
- Temporal: "before screening"
- Reference_point: "screening"
- Measurement: "follicle-stimulating hormone [FSH]"
- Value: "> 40 IU/L"
- Temporal: "at screening"
- Reference_point: "screening"